Clinical trial exclusion criteria:
Patients who will not get surgical treatment for their endometrial cancer
Patients not suffering from endometrial or epithelial ovarian cancer
Patients who do not agree to the proposed treatment or will receive (part of) the treatment in a non-participating centre
Patients who cannot or do not want to give informed consent (including language barriers)

Annotated entities:
- Negation: "not"
- Procedure: "surgical treatment"
- Condition: "endometrial cancer"
- Condition: "epithelial ovarian cancer"
- Condition: "endometrial ovarian cancer"
- Negation: "not"
- Negation: "not"
- Observation: "agree to the proposed treatment"
- Visit: "non-participating centre"
- Procedure: "treatment"
- Observation: "give informed consent"
- Negation: "cannot"
- Negation: "do not want to"
- Observation: "language barriers"